初級視覺皮質（primary visual cortex）位於下列何Brodmann area？
A. 19
B. 17
C. 22
D. 45

正確答案：B. 17